張小姐，32歲，過去未曾懷孕或特殊疾病史，因漿液性卵巢癌接受全子宮及雙側卵巢輸卵管切除、骨盆腔及主動脈旁淋巴結摘除、網膜切除手術，術後病理報告發現右側卵巢、骨盆腔淋巴結、主動脈旁淋巴結腫瘤侵犯，網膜有大於兩公分的腫瘤轉移，但子宮及左側卵巢皆無腫瘤侵犯，肺部電腦斷層未顯示有腫瘤，下列何者敘述正確?
A. 患者為第IV期卵巢癌患者
B. 患者為第IIc期
C. 患者術後應接受化學治療，治療藥物以紫杉醇及含鉑化學治療藥物為首選
D. 患者術後應接受化學治療，再加上腹部放射治療

正確答案：C. 患者術後應接受化學治療，治療藥物以紫杉醇及含鉑化學治療藥物為首選